下列有關副交感神經對心血管系統調控的敘述，何者正確？
A. 刺激竇房結（SA node）上F型鈉離子通道（F-type Na+ channels），使細胞膜去極化
B. 直接抑制cAMP 作用，延緩心室肌細胞收縮與放鬆的速率
C. 活化β2 腎上腺素受體（β2 adrenergic receptors），造成血管舒張
D. 增加竇房結（SA node）上鉀離子通透性，使細胞膜過極化

正確答案：D. 增加竇房結（SA node）上鉀離子通透性，使細胞膜過極化